At least 8 micturitions per 24 hours and

The above is a clinical trial inclusion criterion. Annotated with entity spans:
[Multiplier: At least 8] [Condition: micturitions] per 24 hours and